Clinical trial exclusion criterion:
Hepatitis B or C infection

Annotated entities:
- Condition: "Hepatitis B infection"
- Condition: "Hepatitis C infection"